Clinical trial exclusion criterion:
Currently lactating

Annotated entities:
- Pregnancy_considerations: "Currently lactating"